Patient with hypersensitivity/allergy to either morphine, NSAIDs, or acetaminophen

The above is a clinical trial exclusion criterion. Annotated with entity spans:
Patient with [Condition: hypersensitivity]/[Condition: allergy] to either [Drug: morphine], [Drug: NSAIDs], or [Drug: acetaminophen]